一位 78 歲男性患者被送至精神科門診，就其太太描述：患者於 9 年前開始出現記憶力變差，想不起原來要做的事，症狀持續約莫 2 年，之後患者逐漸變得沉默寡言，對人帶有強烈敵意，並有迷路、走失 之情形。患者身體健朗，從未有過任何內外科病史。此名患者最有可能之臨床診斷為下列何者？
A. 血管性失智症（vascular dementia）
B. 解離性失憶症（dissociative amnesia）
C. 阿茲海默症（Alzheimer's disease）
D. 巴金森氏症（Parkinson's disease）

正確答案：C. 阿茲海默症（Alzheimer's disease）